History of or intercurrent diphtheria, tetanus, pertussis, hepatitis B, polio, and Haemophilus influenzae type b diseases.

The above is a clinical trial exclusion criterion. Annotated with entity spans:
[Temporal: History] of or intercurrent [Condition: diphtheria], [Condition: tetanus], [Condition: pertussis], [Condition: hepatitis B], [Condition: polio], and [Condition: Haemophilus influenzae type b] diseases.